Clinical trial exclusion criterion:
Severe bradycardia or greater than 1st degree heart block

Annotated entities:
- Condition: "bradycardia"
- Qualifier: "Severe"
- Qualifier: "greater than 1st degree"
- Condition: "heart block"